Significant travel with work.

The above is a clinical trial exclusion criterion. Annotated with entity spans:
[Non-representable: Significant travel with work.]